Clinical trial exclusion criterion:
Has a history of not achieving comfortable CL wear (5 days per week; > 8 hours/day)

Entity relations:
- Has_negation("comfortable CL wear", "not")
- Has_temporal("comfortable CL wear", "history")